What is the indication for isradipine?

Isradipine is safe and effective when administered long-term in the treatment of hypertensive patients